何種蛋白質具下列三種特性？     a.由六個蛋白質構成的六聚體  
   b.具 RNA-DNA 解旋活性  
 	  c.能與新合成 RNA 3'-端富 C-序列的區域結合
A. 核糖體（ribosome）
B. 抗終止子（anti-terminator）
C. 操縱子（transcription factor）
D. ρ因子-依賴終止子（ρ factor-dependent terminator）

正確答案：D. ρ因子-依賴終止子（ρ factor-dependent terminator）